一位 28 歲婦女罹患第 1 型糖尿病約 10 年，HbA1c 6.5%，血壓為 140/90 mmHg，檢驗尿中之白蛋白（albumin）與creatinine之濃度比值為 26.5 μg/mg，下列處置何者最適當？
A. 安排腎臟超音波檢查
B. 給予angiotensin converting enzyme inhibitor治療
C. 給予鈣離子阻斷劑治療
D. 半年後再追蹤

正確答案：B. 給予angiotensin converting enzyme inhibitor治療